有關副甲狀腺的敘述，下列何者正確？
A. 胚胎來源全來自第三咽弓
B. 共有兩個腺體左右對稱
C. 位於甲狀腺的表面
D. 分泌的激素主要為降鈣素（calcitonin）

正確答案：C. 位於甲狀腺的表面